Uncontrolled hypertension (systolic blood pressure> 180 mm Hg. and / or diastolic blood pressure> 100 mm.hg in patients receiving antihypertensive drugs).

The above is a clinical trial exclusion criterion. Annotated with entity spans:
[Qualifier: Uncontrolled] [Condition: hypertension] ([Measurement: systolic blood pressure][Value: > 180 mm Hg]. and / or [Measurement: diastolic blood pressure][Value: > 100 mm.hg] in patients receiving [Drug: antihypertensive drugs]).